Any active respiratory, cardiovascular or other disease requiring regular treatment or being otherwise relevant for tolerance of hypoxia or altitude exposure.

The above is a clinical trial exclusion criterion. Annotated with entity spans:
Any [Qualifier: active] [Condition: respiratory], [Condition: cardiovascular] or [Qualifier: other] [Condition: disease] requiring [Qualifier: regular] [Procedure: treatment] or being otherwise [Mood: relevant for] [Condition: tolerance] of [Condition: hypoxia] or [Observation: altitude exposure].